Clinical trial exclusion criterion:
17. Active, uncontrolled infection

Annotated entities:
- Condition: "infection"
- Qualifier: "uncontrolled"
- Temporal: "Active"